血中腎上腺素（epinephrine）濃度增加時，主要會引起下列何種現象？
A. 減少 cAMP 產生
B. 活化蛋白質激酶 A（protein kinase A）
C. 降低肝細胞肝醣之分解
D. 抑制糖質新生（gluconeogenesis）

正確答案：B. 活化蛋白質激酶 A（protein kinase A）